Clinical trial exclusion criteria:
use more than 2g a day; 5 times a week to everyday
Subjects who are diagnosed as suffering from psychotic illness according to DSM-IV (Axis 1)22, or with a history of CNS disease, a history of infection that might affect CNS (HIV, syphilis, cytomegalovirus, herpes), or a history of head injury with loss of consciousness,pregnant women.

Annotated entities:
- Multiplier: "more than 2g a day"
- Multiplier: "5 times a week to everyday"
- Condition: "psychotic illness"
- Measurement: "DSM-IV"
- Qualifier: "Axis 1"
- Temporal: "history"
- Condition: "CNS disease"
- Temporal: "history"
- Condition: "infection"
- Qualifier: "affect CNS"
- Condition: "HIV"
- Condition: "syphilis"
- Condition: "cytomegalovirus"
- Condition: "herpes"
- Temporal: "history"
- Condition: "head injury"
- Condition: "loss of consciousness"
- Condition: "pregnant"